3. Clear amniotic fluid

The above is a clinical trial inclusion criterion. Annotated with entity spans:
[Parsing_Error: 3.] [Observation: Clear amniotic fluid]